Clinical trial exclusion criterion:
allergy to artemisinin drugs

Annotated entities:
- Drug: "artemisinin drugs"
- Condition: "allergy"